Clinical trial exclusion criterion:
Current treatment with Telbivudine

Annotated entities:
- Drug: "Telbivudine"